父親有血友病（hemophilia A）的正常女性和凝血功能正常之男士結婚。婚後懷孕，其生出之男嬰罹 患血友病的機會有多少%？
A. 0
B. 25
C. 50
D. 100

正確答案：C. 50